No other major disease that prohibits study treatment (e.g., severe congenital heart disease)

The above is a clinical trial exclusion criterion. Annotated with entity spans:
[Negation: No] [Qualifier: other] [Condition: major disease] [Non-query-able: that prohibits study treatment] (e.g., [Qualifier: severe] [Condition: congenital heart disease])